Clinical trial exclusion criterion:
Known hypersensitivity to any of the components of the solution

Annotated entities:
- Condition: "hypersensitivity"
- Non-representable: "Known hypersensitivity to any of the components of the solution"
- Drug: "components of the solution"